Clinical trial exclusion criterion:
Previous malignancies within 2 yrs. unless relapse risk is small (< 5%).

Entity relations:
- Has_temporal("malignancies", "within 2 yrs.")